Clinical trial exclusion criterion:
History of sensitivity to study medications or any of their excipients

Annotated entities:
- Condition: "sensitivity"
- Drug: "study medications"